HIV negative

The above is a clinical trial inclusion criterion. Annotated with entity spans:
[Measurement: HIV] [Value: negative]